Clinical trial inclusion criterion:
Bilirubin < 20.0mg/dL (if Gilberts then < 2.5 mg/dL) and AST/AST < 2.5 ULN

Entity relations:
- Has_value("Gilberts", "< 2.5 mg/dL")
- Has_value("Bilirubin", "< 20.0mg/dL")
- Has_value("AST/AST", "< 2.5 ULN")
- OR("< 20.0mg/dL", "Gilberts")